18-50 ages

The above is a clinical trial inclusion criterion. Annotated with entity spans:
[Value: 18-50] [Person: ages]